chronic lower urinary tract infections (but not simple asymptomatic bacteriuria)

The above is a clinical trial exclusion criterion. Annotated with entity spans:
[Qualifier: chronic] [Condition: lower urinary tract infections] (but [Negation: not] simple [Condition: asymptomatic bacteriuria])